Clinical trial exclusion criterion:
Significant autoimmune disease including but not limited to immune cytopenias, rheumatoid arthritis, systemic lupus erythematosus, other connective tissue disorders, vasculitis, inflammatory bowel disease, severe psoriasis

Entity relations:
- Has_qualifier("psoriasis", "severe")
- Subsumes("autoimmune disease", "immune cytopenias,")
- OR("immune cytopenias,", "inflammatory bowel disease", "vasculitis", "connective tissue disorders", "systemic lupus erythematosus", "rheumatoid arthritis,", "psoriasis")